Clinical trial exclusion criterion:
Inability to refrain from NSAID use for 5 days prior to and 6 weeks after injection

Entity relations:
- Has_temporal("NSAID", "5 days prior to and 6 weeks after injection")
- Has_index("5 days prior to and 6 weeks after injection", "injection")
- Has_mood("NSAID", "Inability to refrain from")